Clinical trial inclusion criterion:
3. Have a Karnofsky performance score of 60 or higher.

Entity relations:
- Has_value("Karnofsky performance score", "60 or higher")